Ability to self-administer inhaled AAT.

The above is a clinical trial inclusion criterion. Annotated with entity spans:
[Post-eligibility: Ability to self-administer inhaled AAT.]